Clinical trial exclusion criterion:
7. Patient known to be Human Immunodeficiency Virus (HIV)-positive

Annotated entities:
- Parsing_Error: "7."
- Measurement: "Human Immunodeficiency Virus (HIV)"
- Value: "positive"